implanted hardware or other material that would prohibit treatment planning or delivery

The above is a clinical trial exclusion criterion. Annotated with entity spans:
[Non-query-able: implanted hardware or other material that would prohibit treatment planning or delivery]